Clinical trial inclusion criterion:
Histologically confirmed colorectal adenocarcinoma

Annotated entities:
- Qualifier: "Histologically confirmed"
- Procedure: "Histologically"
- Condition: "colorectal adenocarcinoma"